Las hormonas tiroideas inhiben:
1. El metabolismo basal.
2. La producción de calor corporal.
3. El crecimiento.
4. El desarrollo y maduración del sistema nervioso central.
5. La secreción de TSH.

Respuesta correcta: 5. La secreción de TSH.